Clinical trial inclusion criterion:
Age between 2 to <17 years at Visit 2.

Annotated entities:
- Person: "Age"
- Value: "between 2 to <17 years"
- Temporal: "at Visit 2"